List known pseudokinases.

TRIB1
TRIB2
TRIB3
MLKL
ULK4
HER3
CASK